Clinical trial inclusion criteria:
Completed "ALO-IIT-012(PEAK study)", without major protocol deviations.
Male, or female, 19 years to 75 years.
Female with childbearing potential who has a negative urine pregnancy test result at study start and willing to continue practice appropriate birth control during the entire duration of study
Subjects completed PEAK can be included within 30 days after End Of the Study
Subjects completed PEAK can be included if their treatment is the same as randomized even after 30 days of End Of the Study.

Annotated entities:
- Post-eligibility: "Completed "ALO-IIT-012(PEAK study)", without major protocol deviations"
- Person: "Male"
- Person: "female"
- Person: "years"
- Value: "19 years to 75"
- Pregnancy_considerations: "Female with childbearing potential who has a negative urine pregnancy test result at study start and willing to continue practice appropriate birth control during the entire duration of study"
- Post-eligibility: "Subjects completed PEAK can be included within 30 days after End Of the Study"
- Post-eligibility: "Subjects completed PEAK can be included if their treatment is the same as randomized even after 30 days of End Of the Study"